下列何種藥物對於硬皮症早期之間質性肺病變（interstitial lung disease）效果最佳？
A. corticosteroid
B. hydroxychloroquine
C. D-penicillamine
D. cyclophosphamide

正確答案：D. cyclophosphamide